下列何者以次級主動運輸方式吸收進入小腸上皮細胞？
A. 胺基酸
B. 膽固醇
C. 鈣
D. 果糖

正確答案：A. 胺基酸